11. Major surgery within 4 weeks prior to enrollment in the study

The above is a clinical trial exclusion criterion. Annotated with entity spans:
11. [Procedure: Major surgery] [Temporal: within 4 weeks prior to enrollment] in the study